Según el modelo diagnóstico que se aporta ¿cuál es un enunciado correcto?: Intolerancia a la actividad (00092) “Dominio 4: Actividad/Reposo” “Clase      4:     Respuestas     cardiovasculares/pulmonares” Definición: Falta de energía fisiológica o psicológica suficiente para tolerar o completar las actividades diarias requeridas o deseadas. Características definitorias: Presión arterial anormal en respuesta a la actividad. Frecuencia cardiaca anormal en respuesta a la actividad. Cambios electrocardiográficos indicadores de arritmias. Disconfort por el esfuerzo. Disnea de esfuerzo. Expresa fatiga. Expresa debilidad. Factores relacionados: Reposo en cama. Debilidad generalizada. Desequilibrio entre aporte y demanda de oxígeno. Inmovilidad. Estilo de vida sedentario.
1. Intolerancia a la actividad r/c reposo en cama m/p expresa fatiga.
2. Intolerancia a la actividad r/c insuficiencia cardiaca m/p debilidad generalizada.
3. Respuesta cardiovascular comprometida r/c reposo en cama m/p expresa fatiga.
4. Problema de actividad y reposo r/c una respuesta cardiopulmonar comprometida m/p cambios electrocardiográficos.
5. Intolerancia a la actividad r/c expresiones de fatiga m/p reposo en cama.

Respuesta correcta: 1. Intolerancia a la actividad r/c reposo en cama m/p expresa fatiga.